Clinical trial inclusion criterion:
Willing to be hospitalized on a research unit for 24 hours, longer if detoxification is needed.

Annotated entities:
- Post-eligibility: "Willing to be hospitalized on a research unit for 24 hours, longer if detoxification is needed"